下列何者是在糖尿病視網膜症（diabetic retinopathy）中最早受到影響的視網膜血管細胞？
A. 微血管內皮細胞
B. 微血管周皮細胞（capillary pericyte）
C. 血管滋養管（vasa vasorum）
D. 纖維母細胞（fibroblast）

正確答案：B. 微血管周皮細胞（capillary pericyte）